Clinical trial inclusion criterion:
Subject are at least 18 years of age

Entity relations:
- Has_value("age", "at least 18 years")